Clinical trial exclusion criterion:
Left ventricular ejection fraction <40%.

Annotated entities:
- Measurement: "Left ventricular ejection fraction"
- Value: "<40%"